下列那一肌肉收縮，可上提第二肋骨（second rib）？
A. 前斜角肌（anterior scalene muscle）
B. 中斜角肌（middle scalene muscle）
C. 後斜角肌（posterior scalene muscle）
D. 鎖骨下肌（subclavius muscle）

正確答案：C. 後斜角肌（posterior scalene muscle）